the last vaccination intervals = 14 days and the last attenuated live vaccine intervals = 28 days

The above is a clinical trial inclusion criterion. Annotated with entity spans:
the [Observation: last vaccination intervals] [Value: = 14 days] and the [Observation: last attenuated live vaccine intervals] [Value: = 28 days]